Clinical trial exclusion criterion:
Current stimulant treatment

Entity relations:
- Has_temporal("stimulant treatment", "Current")